Clinical trial exclusion criterion:
Serum potassium level = 5.5 mEq/L

Entity relations:
- Has_value("Serum potassium level", "= 5.5 mEq/L")